Clinical trial exclusion criterion:
Other contraindication to cetirizine

Entity relations:
- AND("contraindication", "cetirizine")